Clinical trial inclusion criterion:
ejection fraction = 30%

Annotated entities:
- Measurement: "ejection fraction"
- Value: "= 30%"